Clinical trial exclusion criterion:
Class III congestive heart failure

Annotated entities:
- Condition: "congestive heart failure"
- Qualifier: "Class III"